一位 67 歲婦女，3 個月前發現左側乳房外上方有一硬塊，沒有壓痛，但有逐漸長大的現象，她沒有乳癌家族史，以往也沒有外傷、乳房疼痛和乳頭分泌物的情形。理學檢查發現在左側乳房外上方有一個明顯不規則的硬塊，直徑約 1.5 公分，沒有皮膚凹陷、水腫或乳頭收縮的情形，硬塊是可動且沒有固定在胸壁上，同時，腋窩、鎖骨上下淋巴結也沒有腫大情形。則現行乳癌篩檢以下列那一項影像檢查為主？
A. 超音波
B. 乳房攝影
C. 電腦斷層掃描檢查
D. 磁振照影

正確答案：B. 乳房攝影